4. Patient has been taking regular steroid medication.

The above is a clinical trial exclusion criterion. Annotated with entity spans:
4. Patient has been taking [Multiplier: regular] [Drug: steroid medication].